Active tumor treated at the time of inclusion associated with expected survival less than one year

The above is a clinical trial exclusion criterion. Annotated with entity spans:
[Qualifier: Active] [Condition: tumor] [Procedure: treated] [Temporal: at the time of inclusion] associated with [Measurement: expected survival] [Value: less than one year]